一位急性白血病患者的白血病細胞 peroxidase 反應為陰性，並有 CD19, CD10 抗原表現，則此病人為何種白血病？
A. B-細胞急性淋巴芽細胞白血病
B. T-細胞急性淋巴芽細胞白血病
C. 急性單核細胞白血病
D. 急性巨核芽細胞白血病

正確答案：A. B-細胞急性淋巴芽細胞白血病